Patients with impaired cardiac function or clinically significant cardiac diseases.

The above is a clinical trial exclusion criterion. Annotated with entity spans:
Patients with [Condition: impaired cardiac function] or [Qualifier: clinically significant] [Condition: cardiac diseases].